Algunos trabajos muestran indicios de que existe relación entre la calidad del sueño de las personas y la tendencia a la depresión. Para obtener     los   anteriores    resultados,   los investigadores    usaron      dos   cuestionarios distintos, uno sobre la calidad del sueño y otro sobre los síntomas de depresión que asignaban una puntuación a cada paciente en cada uno de ellos. ¿Qué prueba estadística cree usted que utilizaron para contrastar su hipótesis?
1. Prueba “t de Student”.
2. Análisis de regresión logística.
3. Análisis de la varianza.
4. Prueba de “Chi cuadrado”.
5. Coeficiente de correlación.

Respuesta correcta: 5. Coeficiente de correlación.